Las matrices de los materiales compuestos pueden ser:
1. Poliméricas.
2. Poliméricas o metálicas, pero no cerámicas.
3. Poliméricas o cerámicas, pero no metálicas.
4. Metálicas o cerámicas, pero no poliméricas.
5. Poliméricas o metálicas o cerámicas.

Respuesta correcta: 5. Poliméricas o metálicas o cerámicas.